Clinical trial exclusion criterion:
Prior treatment with Acthar in the past 2mos

Entity relations:
- Subsumes("Prior", "in the past 2mos")
- AND("treatment", "Acthar")
- Has_temporal("treatment", "Prior")